下列何者不是氣喘的病理變化？
A. epithelial basement membrane thickness
B. glandular hypertrophy
C. angiogenesis
D. epithelial metaplasia

正確答案：D. epithelial metaplasia